由右耳傳入中樞神經系統的auditory input，將傳至何處？
A. 右側之postcentral gyrus
B. 兩側之posterior temporal gyrus
C. 兩側之superior temporal gyrus
D. 右側之posterior temporal gyrus

正確答案：C. 兩側之superior temporal gyrus